Need for a multiorgan transplantation

The above is a clinical trial exclusion criterion. Annotated with entity spans:
[Mood: Need for] a [Procedure: multiorgan transplantation]